Clinical trial exclusion criteria:
Has chronic hepatitis B (measured by hepatitis B surface antigen test) or active hepatitis C (measured by hepatitis C virus [HCV] Ab test; if positive, HCV ribonucleic acid [RNA] PCR test will be used to confirm active versus past HCV infection), active syphilis infection, chlamydia, gonorrhea, or trichomonas . Active syphilis documented by serology unless positive serology is due to past treated infection
Has had a thyroidectomy or active thyroid disease requiring medication during the last 12 months (not excluded: a stable thyroid supplementation)
Has had major psychiatric illness and/or substance abuse problems during the past 12 months (including hospitalization or periods of work disability) that in the opinion of the investigator would preclude participation
Has been in receipt of any licensed vaccine within 14 days prior to the first dose of study vaccine/placebo, plans to receive within 14 days after the first study vaccination, or plans to receive within 14 days before or after the second, third or fourth vaccination
Is a recipient of a prophylactic or therapeutic HIV vaccine candidate at any time, or a recipient of other experimental vaccine(s) within the last 12 months. For participants who received an experimental vaccine (except HIV vaccine) more than 12 months ago, documentation of the identity of the experimental vaccine must be provided to the sponsor, who will determine eligibility on a case-by-case basis

Annotated entities:
- Condition: "chronic hepatitis B"
- Measurement: "hepatitis B surface antigen test"
- Condition: "active hepatitis C"
- Measurement: "hepatitis C virus [HCV] Ab test"
- Value: "positive"
- Measurement: "HCV ribonucleic acid [RNA] PCR test"
- Qualifier: "active"
- Condition: "syphilis infection"
- Condition: "chlamydia"
- Condition: "gonorrhea"
- Condition: "trichomonas"
- Qualifier: "Active"
- Condition: "syphilis"
- Measurement: "serology"
- Measurement: "serology"
- Value: "positive"
- Condition: "treated infection"
- Negation: "unless"
- Procedure: "thyroidectomy"
- Condition: "thyroid disease"
- Qualifier: "active"
- Drug: "medication"
- Temporal: "during the last 12 months"
- Drug: "thyroid supplementation"
- Qualifier: "stable"
- Negation: "not excluded"
- Condition: "psychiatric illness"
- Qualifier: "major"
- Undefined_semantics: "major"
- Condition: "substance abuse"
- Temporal: "during the past 12 months"
- Procedure: "hospitalization"
- Condition: "work disability"
- Subjective_judgement: "in the opinion of the investigator"
- Context_Error: "preclude participation"
- Drug: "licensed vaccine"
- Temporal: "within 14 days prior"
- Reference_point: "the first dose of study vaccine/placebo"
- Temporal: "within 14 days after"
- Reference_point: "first study vaccination"
- Drug: "study vaccine"
- Drug: "placebo"
- Procedure: "study vaccination"
- Non-query-able: "plans to"
- Temporal: "within 14 days before or after"
- Reference_point: "second, third or fourth vaccination"
- Drug: "vaccination"
- Non-query-able: "plans to"
- Drug: "HIV vaccine candidate"
- Temporal: "at any time"
- Drug: "other experimental vaccine(s)"
- Context_Error: "other experimental vaccine(s)"
- Temporal: "within the last 12 months"
- Qualifier: "therapeutic"
- Qualifier: "prophylactic"
- Drug: "experimental vaccine"
- Drug: "HIV vaccine"
- Negation: "except"
- Temporal: "more than 12 months ago"
- Context_Error: "experimental vaccine"
- Undefined_semantics: "experimental vaccine"
- Subjective_judgement: "case-by-case basis"